Adequate Contraception

The above is a clinical trial inclusion criterion. Annotated with entity spans:
[Qualifier: Adequate] [Procedure: Contraception]